Clinical trial inclusion criterion:
Technical possibility to obtain a new tissue biopsy to determine stathmin level in the tumour recurrence.

Entity relations:
- Has_mood("tissue biopsy", "Technical possibility to obtain")